可以讓相鄰的骨細胞（osteocytes）進行物質交換的構造是什麼？
A. 緊密接合（tight junction）
B. 黏連接合（adhering junction）
C. 胞橋小體（desmosome）
D. 間隙接合（gap junction）

正確答案：D. 間隙接合（gap junction）